males and females greater than or equal to 18 years of age

The above is a clinical trial inclusion criterion. Annotated with entity spans:
[Person: males] and [Person: females] [Value: greater than or equal to 18 years] of [Person: age]